Leg ulcers of greater than 1 year duration

The above is a clinical trial exclusion criterion. Annotated with entity spans:
[Condition: Leg ulcers] of [Temporal: greater than 1 year duration]